conform to the indications of hepatectomy;

The above is a clinical trial inclusion criterion. Annotated with entity spans:
conform to the [Observation: indications of hepatectomy];